Maximal inspiratory pressure (MIP) <70% of predicted;

The above is a clinical trial inclusion criterion. Annotated with entity spans:
[Measurement: Maximal inspiratory pressure (MIP)] [Value: <70% of predicted];